下列那一項不是 RNA 聚合酶（RNA polymerase）轉錄的特性？
A. 結合 DNA 的大小涵蓋約 35 bp
B. 需要鎂離子（Mg2+）
C. 於 5'-OH 末端接上核苷酸
D. 從 5'往 3'方向延長 RNA 序列

正確答案：C. 於 5'-OH 末端接上核苷酸